¿Quién formuló la propuesta de recoger información ya desde el primer contacto para la petición de consulta mediante la ficha telefónica, con el fin de elaborar hipótesis circulares?:
1. La escuela interaccional del Mental Research Institute (MRI).
2. La escuela estratégica.
3. El equipo de Milán liderado por M. SelviniPalazzoli.
4. La escuela estructural.

Respuesta correcta: 3. El equipo de Milán liderado por M. SelviniPalazzoli.